¿Cuál de las siguientes afirmaciones sobre la colchicina no es cierta?
1. Despolimeriza la tubulina.
2. Puede causar nausea y vómitos.
3. Es un uricosúrico.
4. Se emplea en profilaxis de ataques recurrentes de gota.
5. Es un alcaloide.

Respuesta correcta: 3. Es un uricosúrico.